3 歲的小芳這 2 天突然不太願意走路，而且伴有發燒現象。身體診查顯示右膝關節腫脹，疑似化膿性關節炎，下列那一種細菌最常見於此種關節炎中？
A. Haemophilus influenzae type b
B. Staphylococcus aureus
C. Salmonella
D. Streptococcus pneumoniae

正確答案：B. Staphylococcus aureus